Clinical trial exclusion criterion:
persistent pain for other reason

Entity relations:
- Has_qualifier("persistent pain", "other reason")